Clinical trial exclusion criterion:
History of seizures

Annotated entities:
- Temporal: "History"
- Condition: "seizures"